La excreción urinaria máxima de un fármaco se refiere a:
1. La máxima concentración de fármaco inalterado en orina.
2. La máxima velocidad a la que se puede excretar el fármaco inalterado por orina.
3. La cantidad de orina recogida una vez transcurridas 7 semividas biológicas tras la administración del fármaco.
4. La cantidad total de fármaco que se excreta en forma inalterada por orina tras la administración de una determinada dosis.
5. La cantidad de fármaco inalterado recuperada en orina a las 24 horas de la administración de una determinada dosis.

Respuesta correcta: 4. La cantidad total de fármaco que se excreta en forma inalterada por orina tras la administración de una determinada dosis.